研究飲酒與肝細胞癌的關係時，如果選取相同醫院的病人作為對照組，考慮危險因子暴露與就醫機率問題，下列那種病人較適合？
A. 健康檢查
B. 肝硬化
C. 口腔癌
D. 車禍受傷

正確答案：A. 健康檢查